下列何者不會造成單側性鼻漏（unilateral nasal discharge）？
A. 異物
B. 惡性腫瘤
C. 腦脊髓液鼻漏
D. 過敏性鼻炎

正確答案：D. 過敏性鼻炎